Which amino acid residue appears mutated in most of the cases reported with  cadasil syndrome?

CADASIL is caused mostly by missense mutations in the NOTCH3 gene, invariably involving a cysteine residue.